Clinical trial inclusion criterion:
Planned non-cardiac surgery at least after 12 months of implantation of drug eluting stent

Annotated entities:
- Condition: "non-cardiac surgery"
- Temporal: "at least after 12 months of implantation of drug eluting stent"
- Reference_point: "implantation of drug eluting stent"
- Procedure: "implantation"
- Device: "drug eluting stent"
- Mood: "Planned"